Which is the prognostic impact of hypothyroidism in patients with acute myocardial infarction?

Thyroid dysfunction, particularly low T3 syndrome,  is a strong predictor of short-term and long-term poor prognoses in patients with acute myocardial infarctions.